Clinical trial exclusion criteria:
Age < 45 or > 55 years.
Blood disorders or coagulopathy.
Diagnosed or suspected local gynecologic lesion (polyp, adenomyosis, myoma, malignancy or cervical pathology).
Use intrauterine contraceptive device.
Pregnancy related conditions.

Annotated entities:
- Person: "Age"
- Value: "< 45 or > 55 years"
- Condition: "Blood disorders"
- Condition: "coagulopathy"
- Condition: "local gynecologic lesion"
- Mood: "Diagnosed"
- Mood: "suspected"
- Condition: "polyp"
- Condition: "adenomyosis"
- Condition: "myoma"
- Condition: "malignancy"
- Condition: "cervical pathology"
- Device: "intrauterine contraceptive device"
- Condition: "Pregnancy"
- Condition: "conditions"
- Qualifier: "Pregnancy related"